List disorders that have been associated to the polymorphism rs2535629.

schizophrenia and major depressive disorder.